able to understand the study and the NRS scale

The above is a clinical trial inclusion criterion. Annotated with entity spans:
[Observation: able to understand the study] [Non-representable: and the NRS scale]